有關 thiazides 利尿劑的敘述，下列何者錯誤？
A. 產生利鈉作用
B. 降低周邊血管阻力
C. 降低交感神經活性
D. 使血中尿酸濃度增加

正確答案：C. 降低交感神經活性